Clinical trial exclusion criteria:
Any patient with esophageal cancer who is not deemed a surgical candidate or who is not deemed a candidate for the Ivor Lewis technique of esophagectomy (with intrathoracic anastomosis).
Any patient less than 18 years of age

Annotated entities:
- Condition: "esophageal cancer"
- Negation: "not"
- Observation: "candidate"
- Negation: "not"
- Observation: "candidate"
- Procedure: "surgical"
- Qualifier: "Ivor Lewis technique"
- Procedure: "esophagectomy"
- Condition: "intrathoracic anastomosis"
- Qualifier: "with intrathoracic anastomosis"
- Value: "less than 18 years"
- Person: "age"